在組織切片中，下列那一構造是纖維軟骨（fibrocartilage）才有，而規則緻密結締組織中沒有？
A. 纖維母細胞（fibroblasts）
B. 膠原纖維（collagen fibers）
C. 基質（matrix）
D. 陷窩（lacuna）

正確答案：D. 陷窩（lacuna）